原發性弛緩不能（primary idiopathic achalasia）之最根本病變為：
A. 平滑肌肥厚（hypertrophy）
B. 平滑肌萎縮
C. 神經細胞變性（degeneration）
D. 神經細胞活性增加

正確答案：C. 神經細胞變性（degeneration）